Clinical trial exclusion criterion:
Allergy to metronidazole

Annotated entities:
- Condition: "Allergy"
- Drug: "metronidazole"